Which X chromosome abnormalities present lupus-like symptoms?

the accelerated development of systemic lupus erythematosus (sle) in male bxsb mice is associated with the genetic abnormality in its y chromosome